下列何者負責接受鈣離子訊息，進而啟動骨骼肌細胞收縮？
A. myosin
B. actin
C. tropomyosin
D. troponin

正確答案：D. troponin